Clinical trial exclusion criterion:
patients with cancer

Annotated entities:
- Condition: "cancer"